Hypertension (currently taking anti-hypertensive medications or resting blood pressure >140/90 mmHg)

The above is a clinical trial exclusion criterion. Annotated with entity spans:
[Condition: Hypertension] (currently taking [Drug: anti-hypertensive medications] or [Measurement: resting blood pressure] [Value: >140/90 mmHg])